Histologically or cytologically confirmed adenocarcinoma of the breast with locally advanced or metastatic disease, and a candidate for chemotherapy.

The above is a clinical trial inclusion criterion. Annotated with entity spans:
[Qualifier: Histologically] or [Qualifier: cytologically confirmed] [Condition: adenocarcinoma of the breast] with locally advanced or [Condition: metastatic disease], and a [Condition: candidate for chemotherapy].